Clinical trial exclusion criterion:
Has chronic hepatitis B (measured by hepatitis B surface antigen test) or active hepatitis C (measured by hepatitis C virus [HCV] Ab test; if positive, HCV ribonucleic acid [RNA] PCR test will be used to confirm active versus past HCV infection), active syphilis infection, chlamydia, gonorrhea, or trichomonas . Active syphilis documented by serology unless positive serology is due to past treated infection

Annotated entities:
- Condition: "chronic hepatitis B"
- Measurement: "hepatitis B surface antigen test"
- Condition: "active hepatitis C"
- Measurement: "hepatitis C virus [HCV] Ab test"
- Value: "positive"
- Measurement: "HCV ribonucleic acid [RNA] PCR test"
- Qualifier: "active"
- Condition: "syphilis infection"
- Condition: "chlamydia"
- Condition: "gonorrhea"
- Condition: "trichomonas"
- Qualifier: "Active"
- Condition: "syphilis"
- Measurement: "serology"
- Measurement: "serology"
- Value: "positive"
- Condition: "treated infection"
- Negation: "unless"